Unable to take oral medications

The above is a clinical trial exclusion criterion. Annotated with entity spans:
[Condition: Unable to take] [Drug: oral medications]